Hemodynamically unstable in need of acute treatment

The above is a clinical trial exclusion criterion. Annotated with entity spans:
[Condition: Hemodynamically unstable] in need of acute treatment